have a pacemaker

The above is a clinical trial exclusion criterion. Annotated with entity spans:
have a [Device: pacemaker]